Clinical trial exclusion criterion:
History of hypersensitivity reaction to apixaban

Annotated entities:
- Condition: "hypersensitivity"
- Drug: "apixaban"